Clinical trial inclusion criteria:
body mass index (BMI) between 19 to 30 kg/m2 and body weight between 50 to 100 kg inclusive

Annotated entities:
- Measurement: "body mass index (BMI)"
- Value: "between 19 to 30 kg/m2"
- Measurement: "body weight"
- Value: "50 to 100 kg inclusive"